Subject has back or non-radicular leg pain of unknown etiology.

The above is a clinical trial exclusion criterion. Annotated with entity spans:
Subject has [Condition: back] or [Condition: non-radicular leg pain] of [Qualifier: unknown etiology].